Los sistemas 2,4-diaminopteridinas, tales como aminopterina o metotrexato, son buenos agentes antitumorales ya que reducen la biosíntesis de purinas y pirimidinas al inhibir a la enzima:
1. Timidilato sintetasa.
2. Aromatasa.
3. Topoisomerasa.
4. Transcriptasa inversa.
5. Dihidrofolato reductasa.

Respuesta correcta: 5. Dihidrofolato reductasa.